Probable noncompliance

The above is a clinical trial exclusion criterion. Annotated with entity spans:
[Qualifier: Probable] [Condition: noncompliance]